下列有關乳癌術後輔助治療（Adjuvant therapy）的選擇，何者正確？
A. 停經前婦女，以抗荷爾蒙藥物為主
B. 停經後婦女，以化學治療為主
C. 動情激素接受體（ER）為陰性之停經前婦女，以化學治療為主
D. 停經前動情激素接受體之陰、陽性與荷爾蒙治療無關

正確答案：C. 動情激素接受體（ER）為陰性之停經前婦女，以化學治療為主